Variceal bleeding in the last 90 days

The above is a clinical trial exclusion criterion. Annotated with entity spans:
[Condition: Variceal bleeding] [Temporal: in the last 90 days]